皮質醇（cortisol）可以：
A. 促進介白質-1（IL-1）的產生
B. 抑制腫瘤壞死因子 α（TNF-α）的產生
C. 促進介白質-2（IL-2）的產生
D. 促進攝護腺素（prostaglandin）的產生

正確答案：B. 抑制腫瘤壞死因子 α（TNF-α）的產生